Both sexes

The above is a clinical trial inclusion criterion. Annotated with entity spans:
[Person: Both sexes]